腭舌肌（palatoglossus muscle）由何神經支配？
A. 舌咽神經（glossopharyngeal nerve）
B. 副神經（accessory nerve）之顱根（cranial root），轉經迷走神經（vagus nerve）
C. 第十二顱神經
D. 第五顱神經第三支

正確答案：B. 副神經（accessory nerve）之顱根（cranial root），轉經迷走神經（vagus nerve）